Is Huntington's disease caused by a dominate or recessive gene?

Huntington's Disease (HD) is an autosomal dominant neurodegenerative disease